Clinical trial inclusion criterion:
Patients with bilateral age related cataracts, require bilateral cataract phacoemulsification combined Intraocular Lens implantation;

Annotated entities:
- Qualifier: "age related"
- Condition: "cataracts"
- Qualifier: "bilateral"
- Procedure: "cataract phacoemulsification"
- Qualifier: "bilateral"
- Procedure: "Intraocular Lens implantation"